Las membranas filtrantes de acetato de celulosa son compatibles con:
1. Disolventes orgánicos.
2. Soluciones acuosas.
3. Todos los disolventes.
4. Disolventes orgánicos, excepto nitrogenados.
5. Disolventes nitrogenados.

Respuesta correcta: 2. Soluciones acuosas.